林先生 32 歲，剛剛在國內完成博士學位，因為他是念地質學，所以需要到處採集地質標本。兩個月前他有機會到美國加州接近墨西哥邊界沙漠地區整整一個月時間在該地區進行調查，甚至包括一些洞穴。回國以後林先生開始發燒、畏寒、夜間盜汗、乾咳，持續 4 個星期，這段期間林先生開始以為是感冒，醫師也開過抗生素治療，但病情持續無法改善。全身檢查結果除了右胸有約 3 cm 較硬腫塊外，在鼠蹊及腋下也有較小約 1 cm 淋巴腫，血液樣本在 25℃培養，找到具有分節孢子（Arthrospores）之絲狀真菌，分節孢子斷裂呈現桶狀（Barrel-shaped）。組織學則呈現寄生性 spherules，內含內孢子（endospores）。林先生最可能感染那一種病原菌？
A. Histoplasma capsulatum
B. Blastomyces dermatitidis
C. Paracoccidioides brasiliensis
D. Coccidioides immitis

正確答案：D. Coccidioides immitis